Clinical trial exclusion criterion:
Known allergy to both xanthine oxidase inhibitors and rasburicase.

Entity relations:
- AND("allergy", "xanthine oxidase inhibitors")
- AND("allergy", "rasburicase")